Spinal cord compression or brain metastases unless asymptomatic, treated and stable (not requiring steroids)

The above is a clinical trial exclusion criterion. Annotated with entity spans:
[Condition: Spinal cord compression] or [Condition: brain metastases] [Negation: unless] [Condition: asymptomatic], [Qualifier: treated] and [Qualifier: stable] ([Negation: not] requiring [Drug: steroids])